Recanalized (TIMI I-III flow) IRA at coronary angiography.

The above is a clinical trial exclusion criterion. Annotated with entity spans:
[Procedure: Recanalized] ([Qualifier: TIMI I-III flow]) [Condition: IRA] at [Procedure: coronary angiography].